¿Cuál de los siguientes criterios es un predictor de éxito a largo plazo en la terapia de exposición a los trastornos fóbicos?:
1. Que la intensidad del miedo sea intermitente.
2. Que la fobia sea de aparición reciente.
3. Que se produzca mejoría tras las primeras exposiciones.
4. Que exista experiencia previa de tratamiento psicológico.
5. Que el paciente sea consciente de la irracionabilidad de sus temores.

Respuesta correcta: 3. Que se produzca mejoría tras las primeras exposiciones.